Subjects with poor-controlled arterial hypertension (systolic blood pressure> 140 mmHg and diastolic blood pressure > 90 mm Hg) despite standard medical management; Coronary heart disease greater than ClassII; II-level arrhythmia (including QT interval prolongation, for man = 450 ms, for woman = 470 ms) together with Class II cardiac dysfunction;

The above is a clinical trial exclusion criterion. Annotated with entity spans:
[Qualifier: Subjects] with [Qualifier: poor-controlled] [Condition: arterial hypertension] ([Measurement: systolic blood pressure][Value: > 140 mmHg] and [Measurement: diastolic blood pressure] [Value: > 90 mm Hg]) despite standard medical management; [Condition: Coronary heart disease] [Qualifier: greater than ClassII]; [Qualifier: II-level] [Condition: arrhythmia] (including [Condition: QT interval prolongation], for man = 450 ms, for woman = 470 ms) together with [Qualifier: Class II] [Condition: cardiac dysfunction];